Cytochromes含有那種金屬離子？
A. Fe2+
B. Mg2+
C. Co2+
D. Ni2+

正確答案：A. Fe2+